Clinical trial exclusion criterion:
Received an investigational or non-registered medicinal product within 30 days prior to informed consent.

Entity relations:
- Has_index("within 30 days prior to informed consent", "informed consent")
- Has_qualifier("medicinal product", "investigational")
- Has_temporal("medicinal product", "within 30 days prior to informed consent")
- OR("investigational", "non-registered")